Clinical trial exclusion criterion:
Without phone

Entity relations:
- Has_negation("phone", "Without")